假性肌肉肥大（pseudohypertrophy）最常見於下列何種疾病？
A. 運動神經元疾病（motor neuron disease）
B. 小兒麻痺後症候群（post-polio syndrome）
C. 裘馨氏肌肉萎縮症（Duchenne muscular dystrophy）
D. 先天性肌肉強直症（myotonia congenita）

正確答案：C. 裘馨氏肌肉萎縮症（Duchenne muscular dystrophy）